Clinical trial exclusion criterion:
Any treatment directed against active tuberculosis within 6 months preceding initiation of study drugs.

Entity relations:
- Has_qualifier("tuberculosis", "active")
- Has_temporal("tuberculosis", "within 6 months preceding initiation of study drugs")
- AND("treatment", "tuberculosis")